Symptoms present more than six months

The above is a clinical trial inclusion criterion. Annotated with entity spans:
[Condition: Symptoms] present [Temporal: more than six months]